Clinical trial exclusion criterion:
Patients with hyperkalemia (over 5.5 meq / L)

Annotated entities:
- Condition: "hyperkalemia"
- Value: "over 5.5 meq / L"